Clinical trial exclusion criterion:
Evidence of decompensated liver disease (Childs B-C), hepato-cellular carcinoma, pre-existing severe depression or other psychiatric disease, significant cardiac disease, significant renal disease, seizure disorders or severe retinopathy.

Annotated entities:
- Qualifier: "decompensated"
- Condition: "liver disease"
- Measurement: "Childs"
- Value: "B-C"
- Condition: "hepato-cellular carcinoma"
- Temporal: "pre-existing"
- Qualifier: "severe"
- Condition: "depression"
- Condition: "psychiatric disease"
- Qualifier: "other"
- Condition: "cardiac disease"
- Qualifier: "significant"
- Qualifier: "significant"
- Condition: "renal disease"
- Condition: "seizure disorders"
- Qualifier: "severe"
- Condition: "retinopathy"